El obturador o fiador en una cánula de traqueotomía sirve para:
1. Introducir la cánula externa en el estoma traqueal de forma poco traumática.
2. Aspirar secreciones si se conecta directamente una fuente de vacío.
3. Ayudar a mantener la permeabilidad de la vía aérea artificial.
4. Fijar la cánula evitando su desplazamiento accidental.
5. Permitir que el paciente hable al facilitar que el aire pase a través de las cuerdas vocales.

Respuesta correcta: 1. Introducir la cánula externa en el estoma traqueal de forma poco traumática.